Corneal disease potentially requiring a treatment during the following 3 months

The above is a clinical trial exclusion criterion. Annotated with entity spans:
[Condition: Corneal disease] [Mood: potentially requiring] a [Procedure: treatment] [Temporal: during the following 3 months]